La Inteligencia Fluida, propuesta por R.B. Cattell, engloba aptitudes como:
1. La compresión verbal y la riqueza de vocabulario.
2. Las relaciones semánticas.
3. Los conocimientos mecánicos.
4. Las relaciones y clasificaciones figurativas.

Respuesta correcta: 4. Las relaciones y clasificaciones figurativas.